patient poor responders

The above is a clinical trial exclusion criterion. Annotated with entity spans:
patient [Condition: poor responders]